下列敘述之急診病患，何者最不需要立即做腦部影像檢查？
A. 25 歲病患，滑倒跌坐後撞到頭，Glasgow 昏迷指數 15 分，頭痛合併噁心，到院後已恢復，沒有明顯神經檢查異常
B. 35 歲感染人類免疫缺損病毒的病患，新產生的頭痛，合併發燒、噁心、嘔吐，沒有明顯神經檢查異常
C. 45 歲病患，新發生的頭痛，合併局部神經功能異常
D. 55 歲病患，突發劇烈頭痛合併嚴重嘔吐，沒有明顯神經功能異常

正確答案：A. 25 歲病患，滑倒跌坐後撞到頭，Glasgow 昏迷指數 15 分，頭痛合併噁心，到院後已恢復，沒有明顯神經檢查異常